History of positive skin prick test or blood radio-allergosorbent test (RAST) to grass and/or ragweed pollen

The above is a clinical trial inclusion criterion. Annotated with entity spans:
History of [Value: positive] [Measurement: skin prick test] or [Measurement: blood radio-allergosorbent test (RAST)] to [Qualifier: grass] and/or [Qualifier: ragweed pollen]